Clinical trial exclusion criterion:
Myocardial damage, diabetic coma, heart block

Entity relations:
- OR("Myocardial damage", "heart block", "diabetic coma")